Clinical trial exclusion criterion:
creatinine clearance less than 30 ml/min

Entity relations:
- Has_value("creatinine clearance", "less than 30 ml/min")